What is the function of the ISW1 and CHD1 remodellers in yeast chromatin?

CHD1 and ISW1 compete to set the spacing on most genes, such that CHD1 dominates genes with shorter spacing and ISW1 dominates genes with longer spacing